When was dupilumab approved by EMA?

Dupilumab was approved fby the EMA in 2017.